Clinical trial exclusion criterion:
Administration of licensed vaccines within 2 weeks (for inactivated vaccines) or 4 weeks (for live vaccines) prior to enrolment in this study.

Annotated entities:
- Temporal: "within 2 weeks prior to enrolment in this study"
- Temporal: "within 4 weeks prior to enrolment in this study"
- Drug: "inactivated vaccines"
- Drug: "live vaccines"
- Drug: "licensed vaccines"